Clinical trial inclusion criterion:
Abdominal obesity (>88cm women, >102cm men) AND hypertension (treated or resting blood pressure >140/90

Entity relations:
- Has_value("women", ">88cm")
- Has_value("men", ">102cm")
- AND("Abdominal", "women")
- Has_value("resting blood pressure", ">140/90")
- AND("hypertension", "treated")
- OR("women", "men")
- OR("treated", "resting blood pressure")